Clinical trial exclusion criterion:
Use of any prescription drug or over-the-counter (OTC) medication which is prohibited by the protocol.

Annotated entities:
- Drug: "prescription drug"
- Drug: "over-the-counter (OTC) medication"
- Qualifier: "prohibited by the protocol"